Entre los criterios de derivación de los trastornos alimentarios a un servicio de Urgencias de hospital general para recibir tratamiento médico urgente, se encuentra:
1. Pérdida de peso >50% en los últimos 6 meses (>30 % en los últimos 3 meses).
2. Presencia de episodios bulímicos regulares, es decir, conductas de sobreingesta alimentaria y/o conductas purgativas persistentes (vomitos autoinducidos, abuso de laxantes y uso de diuréticos).
3. Falta de conciencia de enfermedad.
4. Amenorrea y astenia crónicas.

Respuesta correcta: 1. Pérdida de peso >50% en los últimos 6 meses (>30 % en los últimos 3 meses).